Es un estadio larvario en el ciclo biológico de los trematodos:
1. Procercoide.
2. Plerocercoide.
3. Cercaria.
4. Cisticerco.
5. Cisticercoide.

Respuesta correcta: 3. Cercaria.